Clinical trial exclusion criterion:
Currently receiving immunosuppressive or myelosuppressive therapy with, for example, monoclonal antibodies, methotrexate, cyclophosphamide, cyclosporine or azathioprine, or chronic use of corticosteroids.

Entity relations:
- Has_multiplier("corticosteroids", "chronic use")
- Subsumes("immunosuppressive therapy", "monoclonal antibodies")
- Has_temporal("immunosuppressive therapy", "Currently")
- OR("immunosuppressive therapy", "myelosuppressive therapy")
- OR("monoclonal antibodies", "corticosteroids", "cyclosporine", "cyclophosphamide", "methotrexate", "azathioprine")